Clinical trial inclusion criterion:
Subject must have symptoms that are consistent with vasospastic angina with planned Coronary angiography and Provocation test.

Annotated entities:
- Condition: "symptoms"
- Condition: "vasospastic angina"
- Mood: "planned"
- Procedure: "Coronary angiography"
- Procedure: "Provocation test"